Las “plantillas” utilizadas para la preparación de zeolitas sintéticas ricas en silicio consisten en:
1. Estructuras con huecos tetraédricos.
2. Estructuras con huecos octaédricos.
3. Estructuras porosas.
4. Estructuras grandes sin huecos.
5. Cationes grandes de amonio cuaternario.

Respuesta correcta: 5. Cationes grandes de amonio cuaternario.